Clinical trial inclusion criterion:
Postmenopausal women

Annotated entities:
- Condition: "Postmenopausal"
- Person: "women"